Clinical trial inclusion criterion:
Are ambulatory and able to use a toilet independently

Annotated entities:
- Condition: "ambulatory"
- Condition: "able to use a toilet independently"